進入組織之單核球（monocytes），經下列何種細胞素[cytokine(s)]刺激，可以分化成樹突細胞（dendritic  cells）？
A. M-CSF
B. M-CSF＋TNF-α
C. IL-1β
D. GM-CSF＋IL-4

正確答案：D. GM-CSF＋IL-4